¿Cómo se denomina la mezcla de partículas de cementita en una matriz de ferrita alfa?:
1. Martensita.
2. Bainita.
3. Esferoidita.
4. Austenita.

Respuesta correcta: 3. Esferoidita.